Daily narcotic or opiate use for greater than the 2 months prior to enrollment in the study.

The above is a clinical trial exclusion criterion. Annotated with entity spans:
[Multiplier: Daily] [Drug: narcotic] or [Drug: opiate] use [Temporal: for greater than the 2 months prior to enrollment in the study].